Clinical trial exclusion criterion:
Patients with an implantable device that may be susceptible to unintended interaction with the Inspire system.

Annotated entities:
- Non-query-able: "Patients with an implantable device that may be susceptible to unintended interaction with the Inspire system"